Babies who have received phenobarbitone or any other anticonvulsive medication before hospitalization

The above is a clinical trial exclusion criterion. Annotated with entity spans:
[Person: Babies] who have received [Drug: phenobarbitone] or [Qualifier: any other] [Drug: anticonvulsive medication] [Temporal: before hospitalization]